Clinical trial exclusion criterion:
8. Active Hepatitis A, Hepatitis B, or Hepatitis C infection

Entity relations:
- OR("Hepatitis A", "Hepatitis B", "Hepatitis C")